El certificado complementario de protección de medicamentos tiene una duración máxima de:
1. Cinco años.
2. Siete años.
3. Diez años.
4. Quince años.
5. Veinticinco años.

Respuesta correcta: 1. Cinco años.